Clinical trial exclusion criterion:
Presence of sliding hiatus hernia as defined by flap valve grade IV disruption of morphology at gastro-esophageal junction

Entity relations:
- Has_qualifier("hiatus hernia", "sliding")
- Has_value("flap valve disruption of morphology", "grade IV")
- Has_qualifier("hiatus hernia", "at gastro-esophageal junction")
- AND("flap valve disruption of morphology", "hiatus hernia")